Pregnant or nursing women.

The above is a clinical trial exclusion criterion. Annotated with entity spans:
[Condition: Pregnant] or [Condition: nursing] [Person: women].